Clinical trial exclusion criterion:
Night or rotating shift workers

Entity relations:
- OR("Night shift workers", "rotating shift workers")